Prior therapy with agents targeting the DR5 apoptosis pathway

The above is a clinical trial exclusion criterion. Annotated with entity spans:
[Temporal: Prior] [Procedure: therapy] with [Drug: agents targeting the DR5 apoptosis pathway]